¿Qué país ha sido el primero en recibir la validación de la Organización Mundial de la Salud por haber eliminado la transmisión de madre a hijo del VIH (Virus de Inmunodeficiencia Humana) y sífilis:
1. Argentina.
2. Cuba.
3. Nicaragua.
4. Puerto Rico.

Respuesta correcta: 2. Cuba.